Women who are known to be pregnant.

The above is a clinical trial exclusion criterion. Annotated with entity spans:
[Person: Women] who are known to be [Condition: pregnant].